Use of prescription medications not listed above may be allowed at the discretion of the Investigator upon consultation with Rhythm.

The above is a clinical trial exclusion criterion. Annotated with entity spans:
[Subjective_judgement: Use of prescription medications not listed above may be allowed at the discretion of the Investigator upon consultation with Rhythm.]